Pregnant women as determined by Urine ß-HCG pregnancy test

The above is a clinical trial exclusion criterion. Annotated with entity spans:
[Pregnancy_considerations: Pregnant women as determined by Urine ß-HCG pregnancy test]